Clinical trial exclusion criterion:
Severe gastroesophageal reflux

Entity relations:
- Has_qualifier("gastroesophageal reflux", "Severe")